Clinical trial exclusion criterion:
Subject has history of previous myocardial infarction or percutaneous intervention during the last three months.

Entity relations:
- Has_temporal("myocardial infarction", "last three months")
- OR("myocardial infarction", "percutaneous intervention")